3. Willingness to follow recommendations.

The above is a clinical trial inclusion criterion. Annotated with entity spans:
3. [Post-eligibility: Willingness to follow recommendations.]